Shows high disease activity at Screening and Baseline of both a Total Back Pain score of =4 and a Bath Ankylosing Spondylitis Disease Activity Index (BASDAI) score of >= 4

The above is a clinical trial inclusion criterion. Annotated with entity spans:
Shows [Condition: high disease activity] [Temporal: at Screening and Baseline] of both a [Measurement: Total Back Pain score] of [Value: =4] and a [Measurement: Bath Ankylosing Spondylitis Disease Activity Index (BASDAI) score] of [Value: >= 4]